Clinical trial exclusion criterion:
Active liver disease or unexplained persistent elevations of serum transaminases more than three times normal

Annotated entities:
- Condition: "liver disease"
- Measurement: "serum transaminases"
- Value: "more than three times normal"
- Value: "elevations"
- Qualifier: "unexplained"
- Qualifier: "persistent"